Clinical trial exclusion criterion:
Triglycerides > 500 mg/dl with or without use of fibrate;

Entity relations:
- Has_value("Triglycerides", "> 500 mg/dl")